Clinical trial exclusion criterion:
any skin breakdown (pressure sores)

Annotated entities:
- Condition: "skin breakdown"
- Condition: "pressure sores"